A serious, unstable illness, as judged by the Investigator, during the past 3 months before screening/baseline visit including but not limited to: hepatic, renal, gastro-enterologic, respiratory, cardiovascular, endocrinologic, neurologic or immunologic disease;

The above is a clinical trial exclusion criterion. Annotated with entity spans:
A [Qualifier: serious], [Condition: unstable illness], [Qualifier: as judged by the Investigator], [Temporal: during the past 3 months before screening/baseline visit] including but not limited to: [Condition: hepatic], [Condition: renal], [Condition: gastro-enterologic], [Condition: respiratory], [Condition: cardiovascular], [Condition: endocrinologic], [Condition: neurologic] or [Condition: immunologic disease];